Clinical trial exclusion criterion:
Neuromuscular disease

Annotated entities:
- Condition: "Neuromuscular disease"